¿Por qué las subunidades F1 de la ATP sintasa aisladas catalizan la hidrólisis del ATP?
1. No catalizan la hidrólisis del ATP.
2. No es posible aislar las subunidades F1 del complejo ATP sintasa.
3. La subunidad F1 contiene la actividad catalítica de la sintasa.
4. La hidrólisis del ATP es un proceso endotérmico.

Respuesta correcta: 3. La subunidad F1 contiene la actividad catalítica de la sintasa.